Clinical trial exclusion criterion:
Treatment with GLP-1 analogues, Dipeptidyl peptidase-4 inhibitors, or glitazones

Annotated entities:
- Drug: "GLP-1 analogues"
- Drug: "Dipeptidyl peptidase-4 inhibitors"
- Drug: "glitazones"